Patients with concomitant HIV infection or congenital immune deficiency diseases.

The above is a clinical trial exclusion criterion. Annotated with entity spans:
Patients with [Qualifier: concomitant] [Condition: HIV infection] or [Condition: congenital immune deficiency diseases.]